Clinical trial inclusion criterion:
the resected lesion must have been well differentiated and confined to the mucosa (m2 maximum) on histological analysis,

Entity relations:
- AND("histological analysis", "resected lesion")
- Has_qualifier("resected lesion", "well differentiated")
- Subsumes("confined to the mucosa", "m2 maximum")
- Has_qualifier("resected lesion", "confined to the mucosa")